篩檢發展遲緩兒童工具的篩檢成效，與下列那一因素無關？
A. 篩檢工具的敏感度（sensitivity）
B. 篩檢工具的特異度（specificity）
C. 定期篩檢的頻率
D. 發展遲緩兒童的發生率（incidence）

正確答案：D. 發展遲緩兒童的發生率（incidence）